Clinical trial exclusion criterion:
patients with immunodeficiency and malignant tumors during the treatment period, receiving immunosuppressive therapy (oral steroid) or HIV due to low immunity, or family members have congenital immune disease

Annotated entities:
- Condition: "malignant tumors"
- Condition: "immunodeficiency"
- Temporal: "during the treatment period"
- Procedure: "immunosuppressive therapy"
- Drug: "oral steroid"
- Condition: "HIV"
- Condition: "congenital immune disease"
- Observation: "family members"